Patients who are currently receiving treatment with any medications that have the potential to prolong the QT interval or inducing Torsade de Pointes and the treatment cannot be either safely discontinued at least one week prior to nilotinib treatment or switched to a different medication prior to start of nilotinib treatment and for the duration of the study

The above is a clinical trial exclusion criterion. Annotated with entity spans:
Patients who are [Temporal: currently] receiving [Procedure: treatment] with [Drug: any medications] that [Qualifier: have the potential to prolong the QT interval] or [Qualifier: inducing Torsade de Pointes] and [Non-representable: the treatment cannot be either safely discontinued at least one week prior to nilotinib treatment or switched to a different medication prior to start of nilotinib treatment and for the duration of the study]